下列何者為粒線體電子傳遞鏈Complex II的electron donor？
A. NADH
B. succinate
C. NADPH
D. ubiquinone

正確答案：B. succinate